Which molecule is targeted by the drug Gevokizumab?

Gevokizumab is an allosteric anti-IL-1β monoclonal antibody.